El agua utilizada en la preparación de los jarabes medicamentosos debe:
1. Ser estéril.
2. Ser agua purificada o destilada.
3. Es muy recomendable que contenga anhídrido carbónico disuelto.
4. Contener iones de calcio disueltos.
5. Contener una proporción adecuada de iones magnesio.

Respuesta correcta: 2. Ser agua purificada o destilada.